Clinical trial exclusion criterion:
Patients with history of bleeding disorders or on anticoagulant therapy.

Entity relations:
- Has_temporal("bleeding disorders", "history")
- OR("bleeding disorders", "anticoagulant therapy")